Clinical trial exclusion criterion:
Allergy to liraglutide or any of the active ingredients in liraglutide or other GLP-1 analogue

Annotated entities:
- Condition: "Allergy"
- Drug: "liraglutide"
- Drug: "GLP-1 analogue"